Clinical trial exclusion criterion:
Patients with a history of total or unicompartmental reconstruction of the affected joint

Entity relations:
- Has_qualifier("reconstruction", "total")
- Has_qualifier("reconstruction", "affected joint")
- OR("total", "unicompartmental")